4. Disease severity level: Gross Motor Function Classification System (GMFCS) levels I, II and III.

The above is a clinical trial inclusion criterion. Annotated with entity spans:
[Parsing_Error: 4.] Disease severity level: [Measurement: Gross Motor Function Classification System (GMFCS)] [Value: levels I, II and III].